Clinical trial exclusion criterion:
Acute grief (< 1 month)

Entity relations:
- Has_temporal("Acute grief", "< 1 month")